接受荷爾蒙替代療法（HRT）治療的女性，其冠狀動脈疾病之年發生率為37/10,000，對照組之冠狀動脈疾病年發生率為30/10,000。接受HRT治療發生冠狀動脈疾病的NNH（number needed to harm）為何？
A. 1292
B. 1428
C. 975
D. 2104

正確答案：B. 1428